What disease does BCG immunotherapy used to treat?

BCG immunotherapy is the choice of care for high-grade non-muscle invasive bladder cancer.